Clinical trial exclusion criterion:
Central nervous system aneurysm clip

Annotated entities:
- Device: "Central nervous system aneurysm clip"